Clinical trial exclusion criterion:
Patients who have coma, convulsion or paralysis due to intracranial hemorrhage or central nervous system leukemia at diagnosis.

Annotated entities:
- Condition: "coma"
- Condition: "convulsion"
- Condition: "paralysis"
- Condition: "intracranial hemorrhage"
- Qualifier: "central nervous system"
- Condition: "leukemia"
- Temporal: "at diagnosis"